Clinical trial exclusion criterion:
chronic diarrhea, any clinical signs of volume depletion or a hematocrit > 48 % (women) and > 53 % (men)

Annotated entities:
- Condition: "chronic diarrhea"
- Condition: "volume depletion"
- Measurement: "hematocrit"
- Value: "> 48 %"
- Person: "women"
- Value: "> 53 %"
- Person: "men"
- Measurement: "hematocrit"